一位 75 歲老人，因突發性下肢冰冷及疼痛來診，理學檢查可見右下肢冰冷發紺，摸不出右足背動脈脈搏，心電圖顯示心房顫動，病人過去有抽菸、糖尿病及高血壓病史。下列何者為最可能之診斷？
A. 急性深部靜脈栓塞
B. Buerger's 症
C. 急性下肢動脈阻塞
D. Raynaud's 症

正確答案：C. 急性下肢動脈阻塞